Clinical trial exclusion criterion:
Accelerating angina or unstable angina

Annotated entities:
- Condition: "Accelerating angina"
- Condition: "unstable angina"